關於鋅缺乏（zinc deficiency）引起的皮膚疾病的敘述，下列何者錯誤？
A. 可為先天性或後天性原因造成鋅缺乏
B. 病人在眼睛、口唇及肛門周圍可見急性濕疹樣皮膚病變
C. 病徵以皮疹表現為主，通常不會有掉髮、腹瀉和昏睡等症狀
D. 血液中鋅和alkaline phosphatase的濃度有助於確診

正確答案：C. 病徵以皮疹表現為主，通常不會有掉髮、腹瀉和昏睡等症狀